Los músculos papilares:
1. Contraen las válvulas aurículo-ventriculares.
2. Evitan el reflujo de sangre a las aurículas.
3. Evitan la eversión de las válvulas semilunares.
4. Forman el tabique interventricular.
5. Están formados por músculo liso visceral.

Respuesta correcta: 2. Evitan el reflujo de sangre a las aurículas.